Clinically superinfected digital ulcers

The above is a clinical trial exclusion criterion. Annotated with entity spans:
Clinically [Observation: superinfected] [Condition: digital ulcers]